Clinical trial exclusion criterion:
pulmonary hypertension

Annotated entities:
- Condition: "pulmonary hypertension"